Clinical trial exclusion criterion:
age <45 or >80

Entity relations:
- Has_value("age", "<45 or >80")